下列何者不能延緩微蛋白尿變成明顯腎病變？
A. 血糖控制接近於正常
B. 嚴格之血壓控制
C. Angiotensin converting enzyme（ACE）抑制劑
D. 高蛋白飲食

正確答案：D. 高蛋白飲食